Healthy pregnant women age 18 to 50

The above is a clinical trial inclusion criterion. Annotated with entity spans:
[Condition: Healthy] [Condition: pregnant] [Person: women] [Person: age] [Value: 18 to 50]